Clinical trial inclusion criterion:
elective primary total knee arthroplasty

Annotated entities:
- Qualifier: "elective"
- Qualifier: "primary"
- Procedure: "total knee arthroplasty"